Clinical trial inclusion criterion:
Blood culture-proven typhoid fever (S. typhi or S. paratyphi)

Annotated entities:
- Measurement: "Blood culture"
- Value: "proven"
- Condition: "typhoid fever"
- Condition: "S. typhi"
- Condition: "S. paratyphi"